La reacción de Wittig es uno de los procesos más importantes para obtener:
1. Alquenos.
2. Alcanos.
3. Cetonas.
4. Éteres.
5. Nitrilos.

Respuesta correcta: 1. Alquenos.